Clinical trial exclusion criterion:
Previous exposure to drugs such as fingolimod, natalizumab, alemtuzumab, mitoxantrone and ocrelizumab.

Annotated entities:
- Temporal: "Previous"
- Drug: "drugs"
- Drug: "fingolimod"
- Drug: "natalizumab"
- Drug: "alemtuzumab"
- Drug: "mitoxantrone"
- Drug: "ocrelizumab"